Which chromosome contains the TLR7 locus in the human genome?

The Toll-like receptor 7 (TLR7) gene, encoded on human chromosome Xp22.3, is crucial for type I interferon production.